Medically healthy

The above is a clinical trial inclusion criterion. Annotated with entity spans:
[Observation: Medically healthy]